At the discretion of the operating surgeon, Bilirubin level of < 2.0 mg/dl in the absence of a history of Gilbert's disease (or pattern consistent with Gilbert's).

The above is a clinical trial inclusion criterion. Annotated with entity spans:
[Subjective_judgement: At the discretion of the operating surgeon], [Measurement: Bilirubin level] of [Value: < 2.0 mg/dl] [Negation: in the absence of] a [Temporal: history] of [Condition: Gilbert's disease] (or pattern consistent with Gilbert's).